Major congenital defects or serious chronic illness.

The above is a clinical trial exclusion criterion. Annotated with entity spans:
[Condition: Major congenital defects] or [Condition: serious chronic illness].